Clinical trial exclusion criterion:
Patients who had any complication during phacoemulsification surgery

Annotated entities:
- Qualifier: "any"
- Condition: "complication"
- Procedure: "phacoemulsification surgery"
- Temporal: "during phacoemulsification surgery"
- Reference_point: "phacoemulsification surgery"